Clinical trial exclusion criterion:
Human immunodeficiency virus-positive status

Entity relations:
- Has_value("Human immunodeficiency virus", "positive")